Clinical trial inclusion criterion:
Willing to have buccal administration of misoprostol or a placebo at least one hour pre-procedure.

Entity relations:
- multi("buccal administration", "buccal administration")
- AND("buccal administration", "misoprostol")
- Has_mood("buccal administration", "Willing to have")
- Has_temporal("buccal administration", "at least one hour pre-procedure")
- OR("misoprostol", "placebo")